Clinical trial exclusion criterion:
4. Patient has been taking regular steroid medication.

Entity relations:
- Has_multiplier("steroid medication", "regular")